Female subjects taking hormonal contraceptives or hormone replacement therapy may be included in this study only if they have been on a stable dose for at least 3 months.

The above is a clinical trial exclusion criterion. Annotated with entity spans:
[Person: Female] subjects taking [Drug: hormonal contraceptives] or [Procedure: hormone replacement therapy] [Grammar_Error: may be included] in this study only if they have been on a [Qualifier: stable dose] [Temporal: for at least 3 months].